Clinical trial inclusion criterion:
Sexually active (i.e. =1 attempt/week) males, 40 - 64 years of age (inclusive) at time of screening

Annotated entities:
- Observation: "Sexually active"
- Person: "males"
- Person: "age"
- Value: "40 - 64 years"
- Multiplier: "=1 attempt/week"